Clinical trial exclusion criterion:
Previous adverse reaction to any of the antimalarial drugs used in this study.

Entity relations:
- Has_qualifier("antimalarial drugs", "used in this study")
- Has_temporal("adverse reaction", "Previous")
- AND("adverse reaction", "antimalarial drugs")